有關 Prinzmetal's Angina，下列敘述何者錯誤？
A. 胸痛大多發生於休息時，但亦有三分之一病人之胸痛可於運動中發生
B. 胸痛發生時，常可見心電圖 ST 節段明顯下降
C. 心導管檢查常見無顯著狹窄之冠狀動脈造影
D. 其致病機轉和冠狀動脈痙攣（spasm）有關，且可使用 acetylcholine 誘發之

正確答案：B. 胸痛發生時，常可見心電圖 ST 節段明顯下降